Clinical trial exclusion criterion:
Serum creatinine > 3 mg/dl

Annotated entities:
- Measurement: "Serum creatinine"
- Value: "> 3 mg/dl"